Cuando una persona habla mucho de manera espontánea, de forma rápida, es difícil interrumpirle y no acaba sus frases por una especie de necesidad imperiosa de comunicar algo, es probable que presente el trastorno del pensamiento denominado:
1. Esquizoafasia.
2. Presión del habla.
3. Perseveración.
4. Tangecialidad.
5. Circunstancialidad.

Respuesta correcta: 2. Presión del habla.